AST(aspartate aminotransferase)/ALT(alanine aminotransaminase) >2.5 upper limit of normal

The above is a clinical trial exclusion criterion. Annotated with entity spans:
[Measurement: AST]([Measurement: aspartate aminotransferase])/[Measurement: ALT]([Measurement: alanine aminotransaminase]) [Value: >2.5 upper limit of normal]